Mental retardation.

The above is a clinical trial exclusion criterion. Annotated with entity spans:
[Condition: Mental retardation].